Clinical trial exclusion criterion:
patients with Marfan syndrome;

Annotated entities:
- Condition: "Marfan syndrome"